Clinical trial inclusion criterion:
American Society Anesthesiologists (ASA) physical status I-III

Annotated entities:
- Measurement: "American Society Anesthesiologists physical status"
- Measurement: "ASA"
- Value: "I-III"